No previous iron supplementation

The above is a clinical trial inclusion criterion. Annotated with entity spans:
[Negation: No] [Temporal: previous] [Procedure: iron supplementation]